一位 25 歲女性，最近二個月常常無預警地發生胸悶、心悸、頭暈、呼吸困難、快要死掉的感覺，跑了好幾次急診室，均未檢查出身體毛病，被醫師轉介去看精神科，精神科開了一星期的 fluoxetine 20 mg/錠，囑咐每天早餐後服用一顆，結果雖然沒有發生噁心、頭痛的副作用，但心悸、恐慌、坐立不安的感覺更嚴重，回診時，下列何者是比較適當的處理？
A. 增加 fluoxetine 的劑量為早晚各一顆
B. 降低 fluoxetine 的劑量為每天半顆，等能適應藥物了，再慢慢增加 fluoxetine 劑量
C. 直接停用 fluoxetine，改採認知治療
D. 直接停用 fluoxetine，改用乙型腎上腺素受體阻斷劑（β-adrenergic receptor blocker）治療

正確答案：B. 降低 fluoxetine 的劑量為每天半顆，等能適應藥物了，再慢慢增加 fluoxetine 劑量